Low vitamin B12 Levels (< 300 pg/mL)

The above is a clinical trial exclusion criterion. Annotated with entity spans:
Low [Measurement: vitamin B12 Levels] ([Value: < 300 pg/mL])